Clinical trial inclusion criterion:
Candidate for Gastric By-Pass

Annotated entities:
- Procedure: "Gastric By-Pass"
- Mood: "Candidate"